Signed informed consent

The above is a clinical trial inclusion criterion. Annotated with entity spans:
[Observation: Signed informed consent]